Emergency Department patient

The above is a clinical trial inclusion criterion. Annotated with entity spans:
[Visit: Emergency Department] patient